D. Orem describe el significado de agencia de cuidado dependiente como:
1. Las capacidades desarrolladas y adquiridas por la enfermera en su proceso de formación y aprendizaje.
2. Las capacidades desarrolladas, o en proceso de desarrollo, que tiene una persona para ocuparse de los autocuidados de otra que depende de ella.
3. Las habilidades de la persona madura para satisfacer sus demandas de autocuidado siguiendo las recomendaciones de los profesionales.
4. La relación que se produce entre la enfermera y la persona que requiere de sus cuidados estableciendo un sistema de enfermería acordado entre ambas.
5. Las capacidades de la persona, desarrolladas o en proceso de desarrollo para satisfacer las demandas de los requisitos de desviación de la salud.

Respuesta correcta: 2. Las capacidades desarrolladas, o en proceso de desarrollo, que tiene una persona para ocuparse de los autocuidados de otra que depende de ella.